Clinical trial exclusion criterion:
history of neck surgery or radiotherapy;

Entity relations:
- Has_temporal("neck surgery", "history")
- OR("neck surgery", "radiotherapy")